Clinical trial exclusion criterion:
Any history of allergic reaction to local anesthetics, gastrointestinal bleeding or ulceration;

Annotated entities:
- Temporal: "history"
- Condition: "allergic reaction"
- Drug: "local anesthetics"
- Condition: "gastrointestinal bleeding"
- Condition: "gastrointestinal ulceration"